Under beta-blocker treatment for the last 2 weeks.

The above is a clinical trial exclusion criterion. Annotated with entity spans:
Under [Drug: beta-blocker] treatment [Temporal: for the last 2 weeks].